下列那一種造成呼吸道感染的病毒，可不經由反轉錄作用（reverse transcription），而直接以polymerase  chain reaction（PCR）檢測？
A. 腺病毒（adenovirus）
B. A型流感病毒（influenza A virus）
C. 中東呼吸症候群冠狀病毒（MERS-CoV）
D. 呼吸道細胞融合病毒（respiratory syncytial virus）

正確答案：A. 腺病毒（adenovirus）